阿茲海默症（Alzheimer disease）之患者，其腦部病理變化和臨床症狀最有相關性者是：
A. Negri body
B. neurofibrillary tangles
C. Lewy body
D. Hirano body

正確答案：B. neurofibrillary tangles